¿Qué teoría establece que la ausencia de consistencia interna entre los pensamientos, las creencias, las actitudes y las conductas manifestadas genera sensación aversiva interna, de tensión, en el individuo?:
1. Teoría de la disonancia cognitiva.
2. Teoría del balance.
3. Teoría de la atribución.
4. Teoría del campo.

Respuesta correcta: 1. Teoría de la disonancia cognitiva.